Clinical trial exclusion criterion:
History of malignancy except for treated cervical carcinoma in situ in the past 5 years.

Entity relations:
- AND("treated", "treated")
- AND("malignancy", "cervical carcinoma in situ")
- Has_negation("cervical carcinoma in situ", "except for")
- Has_qualifier("cervical carcinoma in situ", "treated")
- Has_temporal("malignancy", "History")
- Has_temporal("malignancy", "in the past 5 years")